Clinical trial inclusion criterion:
Patients with craniotomy for supratentorial tumors under general anesthesia

Entity relations:
- AND("craniotomy", "supratentorial tumors")
- AND("craniotomy", "general anesthesia")